傷口癒合過程中，適當的膠原組織合成必須有足夠的：
A. 膽固醇
B. 副腎皮質類固醇
C. 維生素 C
D. 維生素 E

正確答案：C. 維生素 C